Clinical trial exclusion criterion:
Untreated coeliac disease or other concomitant condition likely to affect BG control

Annotated entities:
- Condition: "coeliac disease"
- Qualifier: "Untreated"